Clinical trial inclusion criterion:
Accident & Emergency Department patients, requiring parenteral drug sedation (as determined by an emergency clinician) will be enrolled.

Annotated entities:
- Visit: "Accident & Emergency Department"
- Procedure: "parenteral drug sedation"
- Mood: "requiring"